Clinical trial exclusion criterion:
2. history of congestive heart failure, unstable cardiac arrhythmias, hypertrophic cardiomyopathy, severe aortic stenosis, angina or dyspnea at rest or during ADL's;

Entity relations:
- AND("history", "congestive heart failure")
- OR("congestive heart failure", "unstable cardiac arrhythmias", "hypertrophic cardiomyopathy", "severe aortic stenosis", "angina", "dyspnea during ADL's", "dyspnea at rest")